50 歲男性病人，三天前因嚴重頭痛到院，經電腦斷層與血管攝影檢查後診斷出大腦動脈瘤（cerebral  arterial aneurysm），現進行手術。對麻醉的誘導和維持，下列敘述何者錯誤？
A. 需動脈導管（arterial catheter）監測血壓
B. 麻醉誘導須避免突然血壓上升（acute hypertension）
C. 手術中選擇性低血壓（induced hypotension）常使用高濃度 isoflurane 合併 nitroprusside
D. 手術中過度換氣，造成動脈二氧化碳氣體壓力（PaCO2）的下降，可增加腦部血流量（cerebral blood flow）

正確答案：D. 手術中過度換氣，造成動脈二氧化碳氣體壓力（PaCO2）的下降，可增加腦部血流量（cerebral blood flow）